Clinical trial inclusion criterion:
patients have a good understanding and could coordinate with investigators for the trial.

Annotated entities:
- Subjective_judgement: "patients have a good understanding and could coordinate with investigators for the trial"